Clinical trial exclusion criterion:
creatinine > 2,5 mg/dl

Entity relations:
- Has_value("creatinine", "> 2,5 mg/dl")